Clinical trial exclusion criterion:
platelet count less than 100.000/mm3;

Entity relations:
- Has_value("platelet count", "less than 100.000/mm3")